Clinical trial inclusion criterion:
Hepatitis B e antigen (HBeAg)-negative.

Entity relations:
- Subsumes("Hepatitis B e antigen", "HBeAg")
- Has_value("Hepatitis B e antigen", "negative")